Clinical trial inclusion criterion:
Total ankylosis of the spine

Annotated entities:
- Condition: "Total ankylosis of the spine"